Current involvement in another comparable study.

The above is a clinical trial exclusion criterion. Annotated with entity spans:
[Competing_trial: Current involvement in another comparable study.]